有關「告知後同意（informed consent）」的敘述，下列何者錯誤？
A. 只要同意書簽具後，不僅代表已盡告知義務，也可免除醫師法律責任
B. 一旦產生併發症，醫療疏失的責任還是必須從醫學的邏輯上來判斷
C. 仔細的解釋與良好的溝通技巧，有助於避免醫療糾紛
D. 依據醫療法第 63 條規定，緊急情況可以不用取得同意書

正確答案：A. 只要同意書簽具後，不僅代表已盡告知義務，也可免除醫師法律責任